Clinical trial inclusion criterion:
Patient has no other comorbidities that contraindicate the procedure

Annotated entities:
- Negation: "no"
- Qualifier: "other"
- Condition: "comorbidities that contraindicate the procedure"